下列何構造不是由中胚層細胞衍生成的？
A. 軟骨
B. 乳腺
C. 腎上腺皮質部
D. 脾

正確答案：B. 乳腺